Computational tools for predicting allosteric pathways in proteins

A Monte Carlo (MC) path generation approach is proposed and implemented to define likely allosteric pathways through generating an ensemble of maximum probability paths. A novel method, "MutInf", to identify statistically significant correlated motions from equilibrium molecular dynamics simulations. CorrSite identifies potential alloster-binding sites based on motion correlation analyses between cavities. The Correlation of All Rotameric and Dynamical States (CARDS) framework for quantifying correlations between both the structure and disorder of different regions of a protein